下列有關心臟超音波臨床應用之敘述，何者錯誤？
A. 心臟超音波檢查不易偵測到心包膜積水
B. M-mode 超音波常用以測量左心室之大小
C. Two-dimensional 超音波常用於檢查各種心臟切面的異常變化
D. Doppler 超音波常用於檢查血流變化

正確答案：A. 心臟超音波檢查不易偵測到心包膜積水